Clinical trial exclusion criterion:
Known or suspected pregnant women

Annotated entities:
- Condition: "pregnant"
- Person: "women"
- Mood: "suspected"
- Mood: "Known"